eGFR <45

The above is a clinical trial exclusion criterion. Annotated with entity spans:
[Measurement: eGFR] [Value: <45]